Clinical trial exclusion criterion:
Chronic opiate use

Annotated entities:
- Multiplier: "Chronic"
- Drug: "opiate"